Clinical trial inclusion criterion:
Hemoglobin >9 g/dL (Note: Patients may be transfused or receive erythropoietin to maintain or exceed this level).

Annotated entities:
- Measurement: "Hemoglobin"
- Value: ">9 g/dL"
- Non-representable: "(Note: Patients may be transfused or receive erythropoietin to maintain or exceed this level)"